Clinical trial inclusion criteria:
patients were 18 years old or more,
naive to HCV treatment,
HCV genotype 4,
compensated liver disease.

Annotated entities:
- Value: "18 years old or more"
- Person: "old"
- Procedure: "HCV treatment"
- Negation: "naive"
- Measurement: "HCV genotype"
- Value: "4"
- Qualifier: "compensated"
- Condition: "liver disease"